Clinical trial inclusion criterion:
Ride home from dilator insertion clinic appointment

Annotated entities:
- Observation: "Ride home"
- Procedure: "dilator insertion"